Clinical trial exclusion criterion:
Spasticity

Annotated entities:
- Condition: "Spasticity"